真菌中最常見的無性孢子是何種孢子？
A. 分生孢子
B. 芽生孢子
C. 孢子囊孢子
D. 厚膜孢子

正確答案：A. 分生孢子